Poorly controlled pulmonary disease (severe asthma or COPD) -Contraindication to regional anesthesia (recent anticoagulant use)

The above is a clinical trial exclusion criterion. Annotated with entity spans:
[Qualifier: Poorly controlled] [Condition: pulmonary disease] ([Qualifier: severe] [Condition: asthma] or [Condition: COPD]) -[Condition: Contraindication] to [Procedure: regional anesthesia] ([Temporal: recent] [Drug: anticoagulant] use)